一位57歲男性病人因經常性流鼻血至急診處，無高血壓、糖尿病等病史，但有多次黑便及腸胃道出血，血液檢查血紅素偏低，其它凝血因子、血小板等均正常，耳鼻喉理學檢查發現鼻與舌部有多處似血管擴張之紅點。此病人之最可能診斷為何？
A. 鼻過敏
B. Osler-Weber-Rendu syndrome
C. Sipple's syndrome
D. 鼻咽癌

正確答案：B. Osler-Weber-Rendu syndrome